通常會出現在韌帶（ligament）或肌腱（tendon）與硬骨相接處的是？①透明軟骨（hyaline cartilage）  ②彈性軟骨（elastic cartilage） ③纖維軟骨（fibrocartilage）
A. 只有①
B. 只有②
C. 只有③
D. ①②都有

正確答案：C. 只有③